Implanted neural stimulator

The above is a clinical trial exclusion criterion. Annotated with entity spans:
[Device: Implanted neural stimulator]